Clinical trial inclusion criterion:
General state with Karnowsky greater than 80, ECOG = 0, 1 or 2.

Entity relations:
- Has_value("Karnowsky", "greater than 80")
- Has_value("ECOG", "0, 1 or 2")